Clinical trial exclusion criterion:
Known allergy to both xanthine oxidase inhibitors and rasburicase.

Annotated entities:
- Drug: "xanthine oxidase inhibitors"
- Drug: "rasburicase"
- Condition: "allergy"
- Condition: "allergy"